Clinical trial exclusion criterion:
Severe hepatic dysfunction (Child-Pugh class C) or severe renal dysfunction (requirement of renal replacement therapy before surgery);

Annotated entities:
- Qualifier: "Severe"
- Condition: "hepatic dysfunction"
- Measurement: "Child-Pugh"
- Value: "class C"
- Qualifier: "severe"
- Condition: "renal dysfunction"
- Procedure: "renal replacement therapy"
- Temporal: "before surgery"
- Reference_point: "surgery"
- Procedure: "surgery"